因動脈硬化而導致的腹主動脈瘤（abdominal aneurysm）容易發生破裂的原因為何？
A. 高的血管壁應力（wall stress）
B. 高的血流速度
C. 高的血管阻力
D. 高的血管順應性（compliance）

正確答案：A. 高的血管壁應力（wall stress）